Clinical trial exclusion criterion:
Form of diagnosed psoriasis other than chronic plaque psoriasis (i.e. guttate, erythrodermic, pustular)

Annotated entities:
- Condition: "psoriasis"
- Negation: "other than"
- Condition: "chronic plaque psoriasis"
- Qualifier: "guttate"
- Qualifier: "erythrodermic"
- Qualifier: "pustular"